Clinical trial exclusion criterion:
Bleeding diathesis

Annotated entities:
- Condition: "Bleeding diathesis"